Clinical trial exclusion criterion:
Has a spectacle cylinder ≥1.00D of cylinder in either eye.

Entity relations:
- Has_value("spectacle cylinder", "≥1.00D")